一位 37 歲男性 HIV 抗體陽性病人，具臉部、軀體及四肢多處紅紫色斑疹，數個斑疹亦呈結節性變化。 個月之前開始出現，並逐漸增大。這些病變中最可能偵測到何種病毒？
A. 巨細胞病毒（cytomegalovirus）
B. EB 病毒（Epstein-Barr virus）
C. 人類疱疹病毒第八型（human herpesvirus 8）
D. 人類免疫缺損病毒第一型（HIV-1）

正確答案：C. 人類疱疹病毒第八型（human herpesvirus 8）